Clinical trial exclusion criterion:
Patients with anticipated difficult airway management (as this may require medications and/or airway manipulations resulting in increased IOP)

Annotated entities:
- Observation: "difficult airway management"